Single shot local nerve block prior to surgery was ineffective

The above is a clinical trial exclusion criterion. Annotated with entity spans:
[Multiplier: Single shot] [Procedure: local nerve block] [Temporal: prior to surgery] was ineffective